在所有因創傷而死亡的案例中，下列何種器官損傷占了百分之五十以上？
A. 創傷性肺部挫傷
B. 創傷性肝臟撕裂傷
C. 創傷性腦部損傷
D. 創傷性心臟挫傷

正確答案：C. 創傷性腦部損傷